Clinical trial exclusion criterion:
Eye disease treated with topical steroids.

Annotated entities:
- Condition: "Eye disease"
- Procedure: "topical steroids"